Measureable disease defined as: ≥ 1 lesion ≥ 1.5 cm single dimension via CT, CT/PET with nodal or mass lesions; Quantifiable circulating tumor cells; or for Waldenström's macroglobulinemia presence of IgM l > 2X ULN; For CTCL: mSWAT > 0

The above is a clinical trial inclusion criterion. Annotated with entity spans:
[Condition: Measureable disease] defined as: [Multiplier: ≥ 1 lesion] [Measurement: ≥ 1.5 cm single dimension] via [Procedure: CT], [Procedure: CT/PET] with [Condition: nodal] or [Condition: mass lesions]; Quantifiable [Condition: circulating tumor cells]; or for [Condition: Waldenström's macroglobulinemia] presence of [Measurement: IgM l] [Value: > 2X ULN]; For [Condition: CTCL]: [Measurement: mSWAT] [Value: > 0]